Clinical trial inclusion criterion:
Women who had regular cycles until at least age 40 and at least one child

Entity relations:
- AND("who had regular cycles until at least age 40", "regular cycles")
- AND("regular cycles", "age")
- Has_value("age", "until at least age 40")